一位 40 歲女性，最近幾個月來常覺得嚴重噁心、嘔吐及食量變少，體重也下降了 6 公斤。上消化道內視鏡檢查發現幾乎所有胃部黏膜皆呈現紅斑狀鵝卵石般變化。上消化道放射影像檢查也發現胃變小且皺縮。若她接受胃切除治療，最可能出現下列何種變化？
A. 胃潰瘍伴隨早期胃癌（gastric ulcer with early gastric carcinoma）
B. 戒環細胞癌（signet-ring cell adenocarcinoma）
C. 瀰漫性大淋巴細胞瘤（diffuse large B cell lymphoma）
D. 慢性萎縮性胃炎（chronic atrophic gastritis）

正確答案：B. 戒環細胞癌（signet-ring cell adenocarcinoma）